Where is the body would the Peyer's patches be found

Peyer's patches (PPs) play a major role in intestinal mucosal immunity and are located in the gut.